一位 36 歲的消防員在救災時從雲梯車上摔下，到急診時 X 光檢查發現第一腰椎爆裂性骨折，身體檢查發現兩下肢肌力為 0 分，完全麻木，沒有任何痛覺，無深部肌腱反射，請問此時在診斷脊椎神經休克（spinal shock）上最重要的檢查應該是下列何者？
A. 電腦斷層攝影
B. 陰莖球、海綿體肌反射
C. 腰椎穿刺檢查
D. 核磁共振攝影

正確答案：B. 陰莖球、海綿體肌反射